Clinical trial inclusion criterion:
1. Are referred to the Cachexia Clinic with involuntary weight loss of >5% of their premorbid weight within the previous 6 months.

Annotated entities:
- Visit: "Cachexia Clinic"
- Condition: "involuntary weight loss"
- Value: ">5% of their premorbid weight"
- Temporal: "within the previous 6 months"